下列有關「新生兒先天性甲狀腺機能低下症篩檢」的敘述，何者錯誤？
A. 特異度比敏感度更重要
B. 不會產生嚴重的副作用
C. 偽陰性造成的結果，會影響病人的早期治療
D. 偽陽性的機會高

正確答案：A. 特異度比敏感度更重要